Clinical trial exclusion criterion:
Clinical, laboratory, or biopsy evidence of cirrhosis

Annotated entities:
- Condition: "cirrhosis"